下列關於 gastric lymphoma 的治療，何者不正確？
A. 對於 early stage 的病人，surgery、chemotherapy 或 radiation therapy 合併 chemotherapy 等三種治療方式，其 disease free 的 survival rate 都相近
B. 若已侵犯 regional lymph node 則為 stage II E
C. radiotherapy 相當有效，無論 tumor 大小都可考慮
D. gastric lymphoma 的 prognosis 比 gastric adenocarcinoma 佳

正確答案：C. radiotherapy 相當有效，無論 tumor 大小都可考慮